Patients may have received chemotherapy for hormone-sensitive metastatic prostate cancer only, but it must not have lasted for more than 6 months. At least 12 months must have elapsed since completion of chemotherapy.

The above is a clinical trial inclusion criterion. Annotated with entity spans:
Patients may have received [Procedure: chemotherapy] for [Qualifier: hormone-sensitive] [Qualifier: metastatic] [Condition: prostate cancer] only, but it must [Negation: not] have [Multiplier: lasted for more than 6 months]. [Temporal: At least 12 months must have elapsed since completion of chemotherapy].